一位72歲的男性病人最近開始發生活動時胸痛症狀，他有高血壓和糖尿病，長期接受藥物治療；身體診察可聽見在心尖部位有第二度收縮期雜音，下列何項診斷工具不應列為初步檢查項目？
A. 胸部X-光片
B. 24-小時心電圖（Holter monitoring）
C. 標準12-導程心電圖
D. 心臟超音波

正確答案：B. 24-小時心電圖（Holter monitoring）